When was Volanesorsen approved in the EU?

In May 2019, volanesorsen was approved in the EU for the treatment of adult patients with familial chylomicronemia syndrome.